Clinical trial exclusion criterion:
Has had a minor surgery ≤7 days prior to the first dose of study medication

Entity relations:
- Has_index("≤7 days prior", "first dose of study medication")
- Has_temporal("minor surgery", "≤7 days prior")